Clinical trial exclusion criterion:
Current non-steroidal anti-inflammatory drug (NSAID) use

Entity relations:
- Subsumes("non-steroidal anti-inflammatory drug", "NSAID")